Symptomatic, unstable or uncontrolled, cardiac arrhythmias. Patients who have stable, rate-controlled atrial fibrillation are eligible for study enrollment.

The above is a clinical trial exclusion criterion. Annotated with entity spans:
[Qualifier: Symptomatic], [Qualifier: unstable] or [Qualifier: uncontrolled], [Condition: cardiac arrhythmias]. Patients who have [Qualifier: stable], [Qualifier: rate-controlled] [Condition: atrial fibrillation] [Grammar_Error: are eligible] for study enrollment.